下列有關於吞嚥困難的敘述，何者錯誤？
A. 頭頸部接受放射線治療後，可能造成附近組織纖維化而導致呑嚥困難
B. 如發生胸部吞嚥困難（thoracic dysphagia），其由食道功能障礙所造成的機率極高
C. 孟德森手法（Mendelsohn maneuver）會減少上食道括約肌打開的程度及打開的時間
D. 吞嚥中有大於五十條肌肉（more than 50 muscles）序列性的興奮及抑制（sequential excitation and inhibition）

正確答案：C. 孟德森手法（Mendelsohn maneuver）會減少上食道括約肌打開的程度及打開的時間